Pulmonary nodule requiring surgery

The above is a clinical trial exclusion criterion. Annotated with entity spans:
[Condition: Pulmonary nodule] requiring [Procedure: surgery]